一位30歲男性搭乘計程車前座，發生車禍後送至急診，身體檢查時左下肢呈現肢體變短，左髖關節屈曲、內收及內旋轉的外觀，最有可能之初步診斷為何？
A. 髖關節前位脫臼
B. 髖關節後位脫臼
C. 股骨頸骨折
D. 股骨轉子間骨折

正確答案：B. 髖關節後位脫臼